Hemoglobin < 11.5 g/dL for females and < 12.5 g/dL for men at screening.

The above is a clinical trial exclusion criterion. Annotated with entity spans:
[Measurement: Hemoglobin] [Value: < 11.5 g/dL] for [Person: females] and [Value: < 12.5 g/dL] for [Person: men] [Temporal: at screening].